Clinical trial exclusion criterion:
Patients ASA III y IV

Entity relations:
- Has_value("ASA", "III y IV")